下列有關寄生蟲之敘述中，何者錯誤？
A. 蘇丹境內同時有羅得西亞錐蟲（Trypanosoma brucei rhodesiense）及岡比亞錐蟲（T. b. gambiense）的分布
B. 有些黑熱病（kala-azar）患者如果治療不當，在一、兩年後同樣的病原蟲可能在皮膚產生病灶
C. 美國境內也曾有本土性枯西氏錐蟲（Trypanosoma cruzi）人體感染的病例
D. 歐美人士至東非野生動物保護區旅行，曾有因此感染羅得西亞錐蟲（Trypanosoma brucei rhodesiense）的病例發生

正確答案：A. 蘇丹境內同時有羅得西亞錐蟲（Trypanosoma brucei rhodesiense）及岡比亞錐蟲（T. b. gambiense）的分布